Clinical trial inclusion criteria:
Diagnosis of sleep disordered breathing or obstructive sleep apnea
Children undergoing elective tonsillectomy or adenotonsillectomy at Children's Healthcare of Atlanta Egleston location
Parent or legal guardian willing to participate, and able to understand and sign the provided informed consent

Annotated entities:
- Condition: "sleep disordered breathing"
- Condition: "obstructive sleep apnea"
- Person: "Children"
- Qualifier: "elective"
- Procedure: "tonsillectomy"
- Procedure: "adenotonsillectomy"
- Visit: "Children's Healthcare of Atlanta Egleston"
- Informed_consent: "Parent or legal guardian willing to participate, and able to understand and sign the provided informed consent"